一位 64 歲女性，長期食慾不振，意識清楚但全身無力，到院時生化檢驗發現[Na+] = 110 meq/L，給予 3% NaCl 靜脈持續滴注 12 小時後，[Na+] = 132 meq/L，此時病患可能發生什麼現象？
A. 急性肺水腫
B. 急性腎衰竭
C. 致命性心律不整
D. 昏迷及四肢癱瘓

正確答案：D. 昏迷及四肢癱瘓